Clinical trial exclusion criterion:
RIF (repeated implantation failure), defined as greater than or equals to (>=) 2 previous failed embryo transfers

Entity relations:
- Has_value("previous failed embryo transfers", "greater than or equals to (>=) 2")
- AND("RIF (repeated implantation failure)", "previous failed embryo transfers")